Previous history of intolerance to recommended target doses of ACEIs or ARBs.

The above is a clinical trial exclusion criterion. Annotated with entity spans:
[Temporal: Previous] [Temporal: history] of [Condition: intolerance] to recommended target doses of [Drug: ACEIs] or [Drug: ARBs].